Compromised neurologic status on exam (specifically assessment of radial, ulnar, and median nerve)

The above is a clinical trial exclusion criterion. Annotated with entity spans:
[Condition: Compromised neurologic status] on exam (specifically assessment of radial, ulnar, and [Qualifier: median nerve])